Clinical trial inclusion criterion:
ASA I, II, III presenting for ambulatory surgery to be performed under general anesthesia

Annotated entities:
- Measurement: "ASA"
- Value: "I"
- Value: "II"
- Value: "III"
- Procedure: "ambulatory surgery"
- Procedure: "general anesthesia"
- Qualifier: "under general anesthesia"